En el entrenamiento en HHSS aplicado a la fobia social se utiliza el modelado para el aprendizaje de determinadas destrezas. El modelo elegido debe ser:
1. Muy competente y mantener constante esa competencia a lo largo de todo el entrenamiento.
2. Ser relativamente competente (un poco más que el sujeto al que entrena) e ir aumentando la competencia a lo largo del entrenamiento.
3. Ser muy competente e ir disminuyendo su competencia.
4. Ser incompetente para que el paciente pueda identificarse con él.
5. Deber ser un poco más competente que el paciente y no progresar para que al avanzar el aprendizaje el paciente lo supere y aumente su motivación.

Respuesta correcta: 2. Ser relativamente competente (un poco más que el sujeto al que entrena) e ir aumentando la competencia a lo largo del entrenamiento.